En los linfocitos T, CD28 es:
1. Un receptor coestimulador.
2. Un ligando de CD2.
3. Una molécula accesoria de adhesión celular.
4. Un receptor inhibidor.

Respuesta correcta: 1. Un receptor coestimulador.